Clinical trial exclusion criterion:
Contraindication to azithromycin use and other prophylactic antibiotic use

Annotated entities:
- Condition: "Contraindication"
- Drug: "azithromycin"
- Qualifier: "other"
- Drug: "prophylactic antibiotic use"